Patient able to consent and comply with protocol requirements

The above is a clinical trial inclusion criterion. Annotated with entity spans:
[Informed_consent: Patient able to consent and comply with protocol requirements]